Clinical trial exclusion criterion:
History of hypersensitivity or adverse reaction to bupivacaine or narcotics

Entity relations:
- AND("hypersensitivity", "bupivacaine")
- OR("bupivacaine", "narcotics")
- OR("hypersensitivity", "adverse reaction")